Not attempting to conceive either at the time of study entry or for at least 2 years after surgery

The above is a clinical trial inclusion criterion. Annotated with entity spans:
[Negation: Not] [Mood: attempting] to [Procedure: conceive] either [Temporal: at the time of study entry] or [Temporal: for at least 2 years after surgery]